Clinical trial exclusion criterion:
Vitamin B12 and/or serum folate deficiency according to the laboratory (re-screening is possible after substitution therapy).

Entity relations:
- OR("Vitamin B12 deficiency", "serum folate deficiency")